18歲男學生，因為上課時發生頭痛、意識混亂、雙腿無力及尿失禁被送到急診。在兩星期前，他曾有幾天的上呼吸道感染、發燒，經過治療後，當時症狀已完全緩解。根據病史，最可能的診斷是：
A. 多發性硬化症（multiple sclerosis）
B. 急性發炎性脫髓鞘多發性神經病變症候群（Guillain-Barré syndrome）
C. 病毒性腦膜腦炎（viral meningoencephalitis）
D. 急性瀰散型腦脊髓炎（acute disseminated encephalomyelitis）

正確答案：D. 急性瀰散型腦脊髓炎（acute disseminated encephalomyelitis）